一位 50 歲的肥胖男性，抱怨最近幾個月來記憶稍差，早上醒來會頭痛，白天比較嗜睡。他的太太注意到他晚上睡覺時鼾聲很大。最可能之診斷是：
A. 猝睡症（narcolepsy）
B. 阻塞性睡眠呼吸中止症候群（obstructive sleep apnea syndrome）
C. 腿部不寧症候群（restless leg syndrome）
D. 快速動眼睡眠行為障礙（REM sleep behavior disorder）

正確答案：B. 阻塞性睡眠呼吸中止症候群（obstructive sleep apnea syndrome）